Clinical trial exclusion criterion:
The contraceptive patch

Annotated entities:
- Device: "contraceptive patch"